Presence of conditions such as preeclampsia, multiparity, preterm labor

The above is a clinical trial exclusion criterion. Annotated with entity spans:
Presence of conditions such as [Condition: preeclampsia], [Condition: multiparity], [Condition: preterm labor]